En la inhibición enzimática
1. Un inhibidor irreversible provoca la desnaturalización del enzima.
2. Los inhibidores acompetitivos se unen al sustrato de la reacción.
3. Un inhibidor competitivo actúa aumentando el valor de Km.
4. Los inhibidores siempre modifican la Vmx.

Respuesta correcta: 3. Un inhibidor competitivo actúa aumentando el valor de Km.